Clinical trial exclusion criterion:
Inability to follow directions or comprehend the English language.

Annotated entities:
- Post-eligibility: "Inability to follow directions or comprehend the English language"